Clinical trial exclusion criterion:
Patients anticipated to receive metronidazole after enrollment.

Annotated entities:
- Drug: "metronidazole"
- Mood: "anticipated"